Clinical trial exclusion criterion:
Renal insufficiency (eGFR < 60 mL/kg/min)

Annotated entities:
- Condition: "Renal insufficiency"
- Measurement: "eGFR"
- Value: "< 60 mL/kg/min"